一位 65 歲慢性阻塞性肺疾（Chronic Obstructive Pulmonary Disease）患者接受 3 個月胸腔復健，下列何種功能會有顯著進步？
A. 肺活量
B. 第一秒吐氣量
C. 休息時之血氧濃度
D. 運動耐力

正確答案：D. 運動耐力